類固醇藥物（corticosteroids）之作用，下列何者錯誤？
A. 促進白血球（leukocytes）凋亡（apoptosis）
B. 促進細胞激素（cytokines）產生
C. 抑制白血球（leukocytes）遷移（migration）
D. 抑制前列腺素（prostaglandins）的產生

正確答案：B. 促進細胞激素（cytokines）產生